history of any stroke, transient ischemic attack or intracranial bleeding

The above is a clinical trial inclusion criterion. Annotated with entity spans:
history of any [Condition: stroke], [Condition: transient ischemic attack] or [Condition: intracranial bleeding]